下列有關類肉瘤（sarcoidosis）的敘述，何者錯誤？
A. 大多數的病人表現雙側肺門淋巴結腫大
B. CD4陽性T細胞所驅動之免疫反應
C. 病理變化為壞死性肉芽腫
D. 病灶可在肺、脾、肝等器官發現

正確答案：C. 病理變化為壞死性肉芽腫